Clinical trial exclusion criterion:
Upper limb bites

Entity relations:
- Has_qualifier("bites", "Upper limb")